Clinical trial inclusion criterion:
antidiabetic treatment with either diet, metformin, DPP4, GLP1, pioglitazone, acarbose, or respective combinations

Entity relations:
- Subsumes("antidiabetic treatment", "diet")
- OR("diet", "metformin", "DPP4", "GLP1", "pioglitazone", "acarbose")